一位 65 歲男性病人，因為意識不清於上午 9 時被送至急診室。他因為支氣管性氣喘長期在外院接受治療，但最近因為搬家用藥較不規則。理學檢查顯示病人有月亮臉、水牛肩、皮膚上可見有瘀青。病人之血壓、血鈉偏低，他的血液檢查最可能出現那一種變化？（參考值 ACTH 10~65 pg/mL；cortisol  AM 5~24 μg/dL，PM 2.5~12.5 μg/dL）
A. ACTH < 5 pg/mL，cortisol < 5 μg/dL
B. ACTH 75 pg/mL，cortisol < 5 μg/dL
C. ACTH 75 pg/mL，cortisol 30 μg/dL
D. ACTH < 5 pg/mL，cortisol 30 μg/dL

正確答案：A. ACTH < 5 pg/mL，cortisol < 5 μg/dL